What does MetaHIT stand for?

Metagenomics of the Human Intestinal Tract (MetaHIT) project are focusing mainly on the human microbiome